What is the association between moon cycle and rupture risk of intracranial aneurysms?

The lunar cycle seems to affect the incidence of intracranial aneurysm rupture, with the new moon being associated with an increased risk of aneurysmal SAH.